Clinical trial inclusion criterion:
A formal diagnosis of Autism or Pervasive Developmental Disorder not otherwise specified (PDD-NOS), given by a child neurologist.

Annotated entities:
- Condition: "Autism"
- Condition: "Pervasive Developmental Disorder not otherwise specified"
- Condition: "PDD-NOS"
- Non-query-able: "given by a child neurologist"